Clinical trial inclusion criterion:
8. Able and willing to give valid written informed consent.

Annotated entities:
- Parsing_Error: "8."
- Non-query-able: "Able and willing to give valid written informed consent."
- Post-eligibility: "Able and willing to give valid written informed consent."